The virus that causes FIP, Feline Infectious Peritonitis belongs to what family?

Feline infectious peritonitis (FIP) is a common and highly lethal coronavirus disease of domestic cats